Clinical trial inclusion criterion:
eGFR at least 60 ml/mn

Annotated entities:
- Measurement: "eGFR"
- Value: "at least 60 ml/mn"